Clinical trial exclusion criterion:
Body weight <50 or >120 kg

Annotated entities:
- Condition: "Body weight"
- Value: "<50 kg"
- Value: ">120 kg"